Clinical trial exclusion criterion:
Any suicidal ideation with intent with or without a plan, at the time of or within 6 months of Screening, as indicated by answering "Yes" to questions 4 or 5 on the Suicidal Ideation section of the Columbia-Suicide Severity Rating Scale (C-SSRS)

Annotated entities:
- Condition: "suicidal ideation"
- Qualifier: "with intent"
- Qualifier: "without a plan"
- Qualifier: "with a plan"
- Temporal: "at the time of Screening"
- Temporal: "within 6 months of Screening"
- Procedure: "Suicidal Ideation section of the Columbia-Suicide Severity Rating Scale (C-SSRS)"
- Measurement: "questions 4"
- Measurement: "questions 5"
- Value: "Yes"